Clinical trial exclusion criterion:
Those residing in another country or planned absence for more than one month.

Annotated entities:
- Non-representable: "Those residing in another country or planned absence for more than one month."